Clinical trial inclusion criterion:
CC resistance (defined as failure of ovulation after receiving 150 mg/day of CC for 5 consecutive days per cycle, for at least 3 consecutive cycles).

Entity relations:
- AND("resistance", "CC")